Which application is the backbone of BioPAXViz?

BioPAXViz is a Cytoscape (version 3) application, providing a comprehensive framework for metabolic pathway visualization.